80 歲老先生，平常有便秘現象，突發嘔吐、頻尿、四肢無力，送至急診室呈現半昏迷狀態，抽血結果發現血鈣 14.2 mg/dL，血磷 2.5 mg/dL，EKG 呈現 PR 延長，T 波高及 ST 縮短。其處置順序那項最優先？
A. 降鈣藥物使用
B. 改正電解質不平衡
C. 利尿劑使用
D. 強迫水分補充

正確答案：D. 強迫水分補充